Clinical trial exclusion criterion:
Have used any systemic or topical antibiotics for ocular infection in the previous 14 days.

Entity relations:
- Has_qualifier("topical antibiotics", "topical")
- AND("systemic antibiotics", "ocular infection")
- Has_temporal("systemic antibiotics", "in the previous 14 days")
- AND("systemic", "ocular infection")
- Has_temporal("systemic", "in the previous 14 days")
- OR("systemic antibiotics", "topical antibiotics")